下列有關腎上腺白質異化症（Adrenoleukodystrophy）的描述，何者錯誤？
A. 此病是種體染色體顯性遺傳之疾病（autosomal dominant）
B. 羅倫左油（Lorenz's oil）可使血中過多異常脂肪酸 hexacosanoic acid 量正常化
C. 羅倫左油（Lorenz's oil）無法使六歲以上已經產生疾病之臨床症狀消失
D. 在無症狀之男性基因帶原者（gene carrier）不建議進行骨髓移植

正確答案：A. 此病是種體染色體顯性遺傳之疾病（autosomal dominant）